王太太，46 歲，抱怨過去幾個月來全身皮膚發癢，且最近越來越厲害。抽血檢查發現 total bilirubin、 alkaline phosphatase 及 cholesterol 上升，且 antimitochondrial antibody titer 也上升。她的肝臟切片最可能出現下列何種病理變化？
A. 肝細胞有銅的堆積（copper deposition）
B. 膽管有肉芽腫炎性破壞（granulomatous destruction）
C. 肝細胞內有許多普魯士藍染色（Prussian blue stain）陽性色素存在
D. 膽管有同心圓狀洋蔥皮般的纖維化（onion-skin fibrosis）

正確答案：B. 膽管有肉芽腫炎性破壞（granulomatous destruction）